Clinical trial inclusion criterion:
Patients must have been on a stable daily dose of weak opioids or strong opioids for at least 72 hours prior to the start the study and must remain at the same dosage for the duration of the study

Annotated entities:
- Drug: "weak opioids"
- Drug: "strong opioids"
- Temporal: "at least 72 hours prior to the start the study"